Clinical trial inclusion criterion:
At least 3 urgency episodes per 3-day diary.

Entity relations:
- Has_multiplier("urgency episodes", "At least 3 per 3-day diary.")